Clinical trial exclusion criterion:
Patients who are on steroid therapy due to positive result of acute rejection test before the baseline.

Entity relations:
- Has_value("acute rejection test", "positive")